Which R/bioconductor package exists for discovery of intergenic transcripts?

Pooling RNA-seq and Assembling Models (PRAM) is a novel approach for discovering intergenic transcripts from large-scale RNA sequencing experiments. Applying PRAM to 30 human ENCODE RNA-seq data sets identified unannotated transcripts with epigenetic signatures similar to those of recently annotated transcripts.